Clinical trial exclusion criterion:
Type 1 diabetes

Annotated entities:
- Condition: "Type 1 diabetes"